Clinical trial exclusion criterion:
3. local steroid injection within 6 weeks or physical therapy within 4 weeks

Annotated entities:
- Procedure: "local steroid injection"
- Temporal: "within 6 weeks"
- Procedure: "physical therapy"
- Temporal: "within 4 weeks"